methotrexate,

The above is a clinical trial exclusion criterion. Annotated with entity spans:
[Drug: methotrexate],